Clinical trial exclusion criterion:
Liver enzymes equal or more than 1.5 times the upper limit of normal

Annotated entities:
- Measurement: "Liver enzymes"
- Value: "equal or more than 1.5 times the upper limit of normal"